Alpha-spectrin and beta-spectrin subunits form parallel or antiparallel heterodimers?

Alpha and beta spectrin subunits form antiparallel spectrin heterodimers by lateral association.